Clinical trial exclusion criterion:
Acetaminophen allergy or already receiving acetaminophen within 24 h of surgery

Annotated entities:
- Drug: "Acetaminophen"
- Condition: "allergy"
- Drug: "acetaminophen"
- Temporal: "within 24 h of surgery"